Cuando la memoria se adapta a la presencia de una droga (por ej., subsensibilizando receptores, sintetizando nuevas proteínas de membrana) de tal forma que la capacidad de la droga (ej., en el alcohol para desordenar las membranas neuronales) es cada vez menor, estamos hablando de:
1. Tolerancia psicológica.
2. Tolerancia cruzada.
3. Tolerancia metabólica.
4. Tolerancia farmacológica.
5. Tolerancia reducida.

Respuesta correcta: 4. Tolerancia farmacológica.